潮氣末二氧化碳分壓（End-tidal CO2, PETCO2）測量儀可以偵測病患吐氣末端氣體中二氧化碳分壓來進行呼吸監測。下列何者最不可能是手術麻醉期間突發性潮氣末二氧化碳分壓銳減的病因？
A. 呼吸管脫落（circuit disconnection）
B. 過度換氣（hyperventilation）
C. 心輸出量突減（abrupt decrease in cardiac output）
D. 呼吸道阻塞（airway obstruction）

正確答案：B. 過度換氣（hyperventilation）